Patients weighing = 80 pounds who are not -intubated prior to surgery,

The above is a clinical trial inclusion criterion. Annotated with entity spans:
Patients [Measurement: weighing] [Value: = 80 pounds] who are [Negation: not] -[Procedure: intubated] [Temporal: prior to surgery],